Clinical trial exclusion criterion:
Serum potassium >=5.1 mmol/L or <3.5 mmol/L at screening, confirmed by a single repeat if deemed necessary.

Entity relations:
- Has_value("Serum potassium", ">=5.1 mmol/L")
- Has_temporal("Serum potassium", "at screening")
- OR(">=5.1 mmol/L", "<3.5 mmol/L")